Which is the most mutated gene in dilated cardiomyopathy (DCM)?

Mutations in the gene encoding lamin A/C (LMNA) cause dilated cardiomyopathy